FIBRO Spect II index consistent with F3 or F4 AND an AST : platelet ration index (APRI) of > 2 during Screening

The above is a clinical trial inclusion criterion. Annotated with entity spans:
[Measurement: FIBRO Spect II index] consistent with [Value: F3 or F4] AND an [Value: AST] : [Measurement: platelet ration index (APRI)] of [Value: > 2] [Temporal: during Screening]